1. Renal insufficiency as an estimated GFR which is < 30 mL/min/1.7m2

The above is a clinical trial exclusion criterion. Annotated with entity spans:
[Parsing_Error: 1.] [Condition: Renal insufficiency] as an [Measurement: estimated GFR] which is [Value: < 30 mL/min/1.7m2]